What is the role of SDE2?

SDE2 is a previously uncharacterized essential gene required for ribosome biogenesis and the regulation of alternative splicing.